7. Subject is willing and able to undergo percutaneous intervention at SOS hospital, if randomized to SOS study arm.

The above is a clinical trial inclusion criterion. Annotated with entity spans:
7. [Post-eligibility: Subject is willing and able to undergo percutaneous intervention at SOS hospital, if randomized to SOS study arm.]